Clinical trial exclusion criterion:
Niacin (must be on stable dose for ≥3 months);

Annotated entities:
- Drug: "Niacin"
- Qualifier: "stable dose"
- Temporal: "≥3 months"